Clinical trial exclusion criterion:
Genetic and metabolic diseases.

Annotated entities:
- Condition: "metabolic diseases"
- Condition: "Genetic diseases"